新生兒若需做心臟手術時，在等待期間可使用下列何種藥物先行維持動脈導管通暢？
A. misoprostol
B. epoprostenol
C. alprostadil
D. latanoprost

正確答案：C. alprostadil